Clinical trial inclusion criterion:
CICC placed in the internal jugular vein or subclavian vein position

Annotated entities:
- Device: "CICC placed"
- Qualifier: "in the internal jugular vein position"
- Qualifier: "in the subclavian vein position"